目前對於子宮頸懷孕未合併出血時之最佳治療方法為：
A. 子宮切開術（hysterotomy）
B. 真空吸引刮除手術（suctional D & C）
C. 藥物化學治療（methotrexate）
D. 子宮頸切除術（trachelectomy）

正確答案：C. 藥物化學治療（methotrexate）